Clinical trial inclusion criterion:
Poorly managed diet controlled diabetes (with HbA1c > 6.5% , not currently taking any glucose lowering therapy, meeting BMI inclusion range)

Entity relations:
- Has_value("HbA1c", "> 6.5%")
- Subsumes("diabetes", "HbA1c")
- Has_negation("glucose lowering therapy", "not")